抗高血壓藥物 captopril 會引起乾咳的副作用主要與下列何種自泌素（autacoid）有關？
A. Angiotensin
B. Bradykinin
C. Serotonin
D. Histamine

正確答案：B. Bradykinin